Clinical trial exclusion criterion:
Multiple bone metastasis or central nervous system metastasis

Entity relations:
- OR("Multiple bone metastasis", "central nervous system metastasis")